Clinical trial inclusion criterion:
E.coli in blood culture

Annotated entities:
- Procedure: "blood culture"
- Value: "E.coli"